人類白血球抗原（human leucocyte antigens, HLA）是：
A. 黏附分子（adhesion molecules）
B. 歸家受器（homing receptors）
C. 主要組織相容複合體分子（major histocompatibility complex molecules）
D. 組織專一性抗原（tissue specific antigens）

正確答案：C. 主要組織相容複合體分子（major histocompatibility complex molecules）